currently taking antimalarial medicines

The above is a clinical trial exclusion criterion. Annotated with entity spans:
currently taking [Drug: antimalarial medicines]